一位 23 歲年輕女性，因為青春痘及手腳多毛來求診，發現她的月經也很不規則，每年只有 2～3 次。 抽血檢查發現她的 FSH 於正常值邊緣，但 LH 值卻很高，最可能的診斷為何？
A. testicular feminization syndrome
B. polycystic ovarian syndrome
C. Sheehan syndrome
D. ovarian theca cell tumor

正確答案：B. polycystic ovarian syndrome